下列何種先天性心臟病，現今仍完全無法以心導管方法（如封堵器 occluder 或線圈 coil）治療？
A. 肌肉型之心室中隔缺損（muscular type ventricular septal defect）
B. 心房中隔缺損（atrial septal defect）
C. 開放性動脈導管（patent ductus arteriosus）
D. 完全型之心內膜墊異常（endocardial cushion defect, complete form）

正確答案：D. 完全型之心內膜墊異常（endocardial cushion defect, complete form）